Patients under chronic use of medications

The above is a clinical trial exclusion criterion. Annotated with entity spans:
Patients under [Multiplier: chronic use] of [Drug: medications]